Patient over 18 years weighing between 65 and 85 Kg

The above is a clinical trial inclusion criterion. Annotated with entity spans:
Patient [Value: over 18] [Person: years] [Measurement: weighing] [Value: between 65 and 85 Kg]